¿Qué orientación teórica predominó en la primera fase de la Medicina Psicosomática?:
1. Conductismo.
2. Psicoanálisis.
3. Existencialismo.
4. Cognitivismo.
5. Psicología Sistémica.

Respuesta correcta: 2. Psicoanálisis.